李小弟因吸入異物，導致區域性的呼吸道阻塞，10 分鐘後經由父母親陪同至急診室求診，以血氧計（pulse oximeter）偵測體循環之動脈血氧飽和度（oxygen saturation）為 90％，可推估此患者體循環之動脈血氧分壓（PaO2）約為多少 mmHg？
A. 90
B. 80
C. 60
D. 40

正確答案：C. 60